What is the role of the positive effector of transcription (pet) in the hepatitis B virus?

In the presence of this region, deletion of pet activates transcription from downstream promoters, suggesting that pregenome transcription complexes fail to reach the downstream promoters. In vitro transcription from downstream promoters, suggesting that pregenome transcription complexes fail to reach the downstream promoters. We speculate that pet is required to suppress transcription termination during the first passage of pregenome transcription complexes through a viral termination region on the circular viral DNA. In vitro transcription experiments support the model that pet is required for transcription elongation on the DHBV template. This element, which we have named pet , exerts its effect in cis in a position and orientation-dependent manner, suggesting that pregenome transcription complexes fail to reach the downstream promoters. We speculate that pet , exerts its effect in cis in a position and orientation-dependent manner, suggesting that it may function as part of the nascent pregenome transcript.